Women requiring hysterectomy for treatment of H Mole

The above is a clinical trial exclusion criterion. Annotated with entity spans:
[Person: Women] requiring [Procedure: hysterectomy] for treatment of [Condition: H Mole]